¿Cuál de los siguientes sustituyentes se comporta como orientador hacia la posición meta cuando dicho átomo o grupo se encuentra sustituyendo a uno de los hidrógenos del benceno y se lleva a cabo sobre dicho benceno sustituido una reacción de nitración que transcurre por un mecanismo de sustitución electrofílica aromática?:
1. Un átomo de cloro.
2. Un grupo alquilo.
3. Un grupo amino.
4. Un grupo nitro.

Respuesta correcta: 4. Un grupo nitro.